下列何種情況出現血小板數目增多（thrombocytosis）的機會最小？
A. iron deficiency anemia
B. polycythemia vera
C. splenectomy
D. hepatitis C virus infection

正確答案：D. hepatitis C virus infection